Clinical trial inclusion criterion:
life expectancy of more than 3 months

Annotated entities:
- Observation: "life expectancy"
- Temporal: "more than 3 months"